Clinical trial exclusion criterion:
Existing a second malignancy within 5 years

Annotated entities:
- Condition: "second malignancy"
- Temporal: "within 5 years"
- Undefined_semantics: "second malignancy"